Clinical trial inclusion criterion:
Patients must agree to have a 20 cc blood sample drawn in addition to routine labs with each cycle of chemotherapy.

Annotated entities:
- Procedure: "blood sample drawn"
- Qualifier: "20 cc"
- Informed_consent: "agree to"
- Procedure: "routine labs"
- Multiplier: "with each cycle of chemotherapy"